What effect does Methylsulfonylmethane (MSM) have on inflammation?

Methylsulfonylmethane (MSM) is a sulfur-based nutritional supplement that is purported to have pain and inflammation-reducing effects.